¿Cuál de los siguientes emparejamientos entre fármaco anticoagulante y mecanismo de acción es INCORRECTO?
1. Heparina - cofactor de la antitrombina III.
2. Acenocumarol - inhibe la vitamina K epóxido reductasa.
3. Dabigatrán - inhibe la trombina.
4. Rivaroxabán - inhibe el factor Xa.
5. Warfarina - inhibe la absorción de la vitamina K.

Respuesta correcta: 5. Warfarina - inhibe la absorción de la vitamina K.